有一種體染色體隱性（autosomal recessive）遺傳的疾病，稱為 familial chylomicronemia，病人血液中的 triglyceride 會因下列何種基因突變，因此造成高血脂症？
A. Pancreatic lipase
B. Endothelial lipase
C. Lipoprotein lipase
D. HMG-CoA reductase

正確答案：C. Lipoprotein lipase